目前提倡的週期性健康檢查，所強調的是：
A. 檢查項目和檢查時間間隔
B. 付費方式
C. 有醫學上的證據顯示對健康有實際的好處
D. 容易執行，不易忘記

正確答案：C. 有醫學上的證據顯示對健康有實際的好處